Clinical trial exclusion criteria:
Active opioid dependence
Acute or chronic pain requiring opioid treatment
Acute liver injury (liver aminotransferase concentrations >5 times the upper limit of normal)
Health condition considered unsafe for inclusion (at discretion of PI and/or attending physician)
Lack of capacity or willingness to consent
Currently prescribed pharmacotherapy for alcohol dependence (not including treatment of acute alcohol withdrawal syndrome)
Previous significant adverse reaction to naltrexone or diluent
Pregnant, nursing, or not using effective methods of birth control
Prisoners (as defined by Office of Human Research Protection) at the time of enrollment ARE NOT ELIGIBLE for study entry. However, subjects who become prisoners after being enrolled will be included and not be withdrawn from the study. Patients on parole or probation are eligible for enrollment.

Annotated entities:
- Qualifier: "Active"
- Condition: "opioid dependence"
- Qualifier: "Acute"
- Qualifier: "chronic"
- Condition: "pain"
- Procedure: "opioid treatment"
- Condition: "Acute liver injury"
- Measurement: "liver aminotransferase concentrations"
- Value: ">5 times the upper limit of normal"
- Condition: "Health condition"
- Qualifier: "considered unsafe for inclusion"
- Non-query-able: "at discretion of PI and/or attending physician"
- Observation: "willingness to consent"
- Negation: "Lack of"
- Observation: "capacity to consent"
- Condition: "alcohol dependence"
- Procedure: "pharmacotherapy"
- Temporal: "Currently"
- Negation: "not including"
- Procedure: "treatment"
- Condition: "acute alcohol withdrawal syndrome"
- Temporal: "Previous"
- Qualifier: "significant"
- Condition: "adverse reaction"
- Drug: "naltrexone"
- Drug: "diluent"
- Condition: "Pregnant"
- Condition: "nursing"
- Negation: "not"
- Procedure: "birth control"
- Qualifier: "effective methods"
- Person: "Prisoners"
- Qualifier: "Office of Human Research Protection"
- Temporal: "at the time of enrollment"
- Reference_point: "the time of enrollment"
- Non-representable: "However, subjects who become prisoners after being enrolled will be included and not be withdrawn from the study. Patients on parole or probation are eligible for enrollment."